having primary corrective heart surgery

The above is a clinical trial inclusion criterion. Annotated with entity spans:
having [Qualifier: primary] [Procedure: corrective heart surgery]